Clinical trial exclusion criterion:
Hypotension.

Annotated entities:
- Condition: "Hypotension"